Clinical trial inclusion criterion:
Has a cataract and is expected to undergo clear corneal cataract surgery with phacoemulsification and implantation of a posterior chamber intraocular lens

Annotated entities:
- Condition: "cataract"
- Procedure: "clear corneal cataract surgery"
- Qualifier: "with phacoemulsification"
- Qualifier: "implantation of a posterior chamber intraocular lens"